Clinical trial exclusion criteria:
Neurological Congenital malformations and/or those known to impair intestinal motility
Additional congenital gastrointestinal abnormalities requiring surgical intervention
Congenital Cyanotic heart disease
Surgical Closure of abdominal wall defect with prosthetic material (e.g. prosthetic or bio-prosthetic mesh)

Annotated entities:
- Condition: "Neurological Congenital malformations"
- Condition: "impair intestinal motility"
- Condition: "gastrointestinal abnormalities"
- Qualifier: "Additional"
- Procedure: "surgical intervention"
- Mood: "requiring"
- Qualifier: "congenital"
- Qualifier: "Congenital"
- Condition: "Cyanotic heart disease"
- Procedure: "Surgical Closure"
- Condition: "abdominal wall defect"
- Device: "prosthetic material"
- Device: "prosthetic mesh"
- Device: "bio-prosthetic mesh"